Moderate/Weak CYP3A inducers such as efavirenz and oxcarbazepine

The above is a clinical trial exclusion criterion. Annotated with entity spans:
[Drug: Moderate]/[Drug: Weak CYP3A inducers] such as [Drug: efavirenz] and [Drug: oxcarbazepine]